輔酶NAD＋、FAD、coenzyme A等分子中之共同結構單元（structure module）為：
A. ADP
B. CDP
C. GDP
D. UDP

正確答案：A. ADP